Clinical trial inclusion criterion:
symptomatic Dupuytrens contracture with palpable cord, involving MCP, total contracture size over 30 degrees

Entity relations:
- Has_value("total contracture size", "over 30 degrees")
- Has_qualifier("Dupuytrens contracture", "symptomatic")
- AND("Dupuytrens contracture", "palpable cord")
- Has_qualifier("Dupuytrens contracture", "involving MCP")
- AND("Dupuytrens contracture", "total contracture size")